Voluntary consent to take part in this trial

The above is a clinical trial inclusion criterion. Annotated with entity spans:
[Informed_consent: Voluntary consent to take part in this trial]